一位 40 歲建築屋瓦工人，主訴乾咳及呼吸困難，胸部 X 光顯示，有蜂巢狀及鈣化現象，其診斷最有可能為何種沈積症？
A. berylliosis
B. anthracosis
C. silicosis
D. asbestosis

正確答案：D. asbestosis